Clinical trial inclusion criterion:
Chronic migraine: by ICHD-III (International Classification of Headache Disorder) criteria

Entity relations:
- Subsumes("ICHD-III", "International Classification of Headache Disorder")
- Has_qualifier("Chronic migraine", "ICHD-III")